下列有關肺癌之敘述，何者正確？
A. 肺鱗狀細胞癌（squamous cell carcinoma）在臺灣最常見
B. 肺腺癌（adenocarcinoma）較肺鱗狀細胞癌易早期轉移
C. 肺腺癌多生長於靠近門區（hilar）
D. 小細胞肺癌（small cell carcinoma）治療以手術為主

正確答案：B. 肺腺癌（adenocarcinoma）較肺鱗狀細胞癌易早期轉移